Acute rejection episode in the last 30 days, or episode > 2A in the Banff criteria;

The above is a clinical trial exclusion criterion. Annotated with entity spans:
[Condition: Acute rejection episode] in the [Temporal: last 30 days], or episode [Value: > 2A] in the [Measurement: Banff criteria];